Los fármacos antipsicóticos atípicos pueden distinguirse de los fármacos antipsicóticos convencionales debido a que:
1. Suelen reducir tanto los síntomas positivos como los negativos.
2. Producen con mayor probabilidad síntomas extrapiramidales.
3. Producen con mayor probabilidad discinesia tardía.
4. Sus diferencias son exclusivamente farmacológicas.

Respuesta correcta: 1. Suelen reducir tanto los síntomas positivos como los negativos.